Clinical trial inclusion criterion:
All prevalent patients (diagnosed >12 month ago) with PAH or distal CTEPH who had a consultation at the PH centre in Zurich between November 2015 and November 2016)

Entity relations:
- Has_qualifier("CTEPH", "distal")
- AND("consultation at the PH centre", "Zurich")
- Has_temporal("consultation at the PH centre", "between November 2015 and November 2016")
- Has_temporal("prevalent", ">12 month ago")
- OR("PAH", "CTEPH")